戴隱形眼鏡導致之角膜潰瘍，下列何種致病菌最常見？
A. 淋球菌（gonococci）
B. 綠膿桿菌（Pseudomonas aeruginosa）
C. 金黃色葡萄球菌（Staphylococcus aureus）
D. 念珠菌（Candida）

正確答案：B. 綠膿桿菌（Pseudomonas aeruginosa）